Patient informed and consent signature obtained

The above is a clinical trial inclusion criterion. Annotated with entity spans:
[Post-eligibility: Patient informed and consent signature obtained]